Clinical trial inclusion criterion:
2. Are 18 years of age or older

Entity relations:
- Has_value("of age", "18 years or older")